Which enzyme is inhibited by ixazomib?

Ixazomib is proteasome inhibitor. It is used for treatment of multiple myeloma.